Clinical trial inclusion criterion:
Male and females aged between 18 and 65 years of age inclusive, at the time of signing the informed consent.

Annotated entities:
- Person: "Male"
- Person: "females"
- Grammar_Error: "and"
- Person: "aged"
- Value: "between 18 and 65 years"
- Person: "age"
- Temporal: "at the time of signing the informed consent"
- Reference_point: "signing the informed consent"